American Society of Anesthesiology Physical Class 1-3.

The above is a clinical trial inclusion criterion. Annotated with entity spans:
[Measurement: American Society of Anesthesiology Physical Class] [Value: 1-3].